Clinical trial exclusion criterion:
Not received neuraxial anesthesia

Annotated entities:
- Procedure: "neuraxial anesthesia"
- Negation: "Not received"